Clinical trial inclusion criterion:
Cervical spine injury with functional loss in the upper extremity

Entity relations:
- Has_qualifier("functional loss", "upper extremity")
- Has_context("Cervical spine injury", "functional loss")